一位唐氏症（Down syndrome, trisomy 21）寶寶，經身體診查發現有收縮期心雜音（grade II/VI），胸部 X 光片顯示心臟擴大，心電圖呈現兩心室肥大及向上之 QRS 軸向（superior QRS axis）。最可能的先天性心臟病為何？
A. 心內膜墊缺損（endocardial cushion defect）
B. 第二型心房中隔缺損（secundum atrial septal defect）
C. 主動脈幹（truncus arteriosus）
D. 主動脈弓窄縮（coarctation of aorta）

正確答案：A. 心內膜墊缺損（endocardial cushion defect）